left atrial thrombus on transesophageal echocardiography study performed after successful left atrial appendage closure but before enrollment

The above is a clinical trial exclusion criterion. Annotated with entity spans:
[Condition: left atrial thrombus] on [Procedure: transesophageal echocardiography] study performed [Temporal: after successful left atrial appendage closure] but [Temporal: before enrollment]